Clinical trial inclusion criterion:
Age >18 years

Annotated entities:
- Person: "Age"
- Value: ">18 years"